Clinical trial exclusion criterion:
Positive serology for C hepatitis in the screening evaluation;

Annotated entities:
- Measurement: "serology for C hepatitis"
- Value: "Positive"
- Temporal: "in the screening evaluation"
- Reference_point: "screening evaluation"